Therapy area was previously received isotope or PDT or other treatment which might interfere with the efficacy evaluation;

The above is a clinical trial exclusion criterion. Annotated with entity spans:
Therapy area was previously received [Drug: isotope] or [Drug: PDT] or other [Procedure: treatment] which [Qualifier: might interfere with the efficacy evaluation];